與精神醫學相比較，公共心理衛生具有何種特性？
A. 強調症狀治療與病情改變
B. 注重個人遺傳與生物因素
C. 重視社區組織和社區參與
D. 加強隔離病人以保護社區

正確答案：C. 重視社區組織和社區參與